治療癲癇之藥物 lamotrigine 與下列那一種藥物合併使用時，lamotrigine 的體內代謝半衰期可以被延長？
A. Topiramate
B. Phenytoin
C. Valproic acid
D. Tiagabine

正確答案：C. Valproic acid